difficult to follow up or patients with poor compliance.

The above is a clinical trial exclusion criterion. Annotated with entity spans:
[Non-query-able: difficult to follow up or patients with poor compliance.]